rheumatic disease (RA, SpA, SLE)

The above is a clinical trial exclusion criterion. Annotated with entity spans:
[Condition: rheumatic disease] ([Condition: RA], [Condition: SpA], [Condition: SLE])